Clinical trial exclusion criterion:
any intraocular surgery within the previous 12 months.

Annotated entities:
- Procedure: "intraocular surgery"
- Temporal: "within the previous 12 months"